El modelo asistencial consistente en la coordinación sistemática de la atención que se presta a grupos específicos de pacientes, durante un episodio de cuidados, para alcanzar los resultados clínicos previstos, tratando de conseguir el menor coste y la mejora de la calidad asistencial, se denomina de:
1. Gestión de Casos.
2. Cuidados Complejos.
3. Práctica Avanzada.
4. Cartera de Servicios.
5. Necesidades de Salud.

Respuesta correcta: 1. Gestión de Casos.